Clinical trial inclusion criteria:
Planned gynecological lower abdomen surgery with epidural pain treatment
Informed consent obtained

Annotated entities:
- Procedure: "gynecological lower abdomen surgery"
- Mood: "Planned"
- Procedure: "epidural pain treatment"
- Non-query-able: "Informed consent obtained"